Clinical trial inclusion criterion:
Prostate cancer patients with a rise in PSA under hormone therapy.

Entity relations:
- Has_value("PSA", "rise")
- AND("hormone therapy", "Prostate cancer")